Which syndrome is caused by dysfunction of the ciliary ARMC9/TOGARAM1 protein?

Dysfunction of the ciliary ARMC9/TOGARAM1 protein module causes Joubert syndrome. Joubert syndrome (JBTS) is a recessive neurodevelopmental ciliopathy characterized by a pathognomonic hindbrain malformation.